Clinical trial exclusion criterion:
life expectancy <1 year

Annotated entities:
- Observation: "life expectancy"
- Value: "<1 year"